Clinical trial exclusion criterion:
Malignant illness requiring systemic chemotherapy in the last 6 months

Annotated entities:
- Condition: "Malignant illness"
- Procedure: "systemic chemotherapy"
- Temporal: "in the last 6 months"